Allergy to used drugs (PEG, neomycin, metronidazole)

The above is a clinical trial exclusion criterion. Annotated with entity spans:
[Condition: Allergy] to used [Drug: drugs] ([Drug: PEG], [Drug: neomycin], [Drug: metronidazole])